Clinical trial inclusion criterion:
American Society of Anesthesiologists physical status class I-III

Entity relations:
- Has_value("American Society of Anesthesiologists physical status", "class I-III")